Hombre de 87 años con antecedentes de hipertensión y gonartrosis. Situación basal con autonomía funcional y cognitiva plena que le permite continuar viviendo solo en la comunidad. Realiza tratamiento habitual con perindopril y diurético tiazídico para control de la presión arterial y toma de forma rutinaria ibuprofeno 1800 mg/día para control de los síntomas derivados de su gonartrosis. Tras control rutinario se objetiva, de forma persistente, una presión arterial de 190 y TAD 80 mmHg. ¿Cuál sería la modificación terapéutica más razonable para conseguir el control de las cifras tensionales?
1. Añadiría un bloqueante del calcio.
2. Aumentaría la dosis de hidroclorotiazida a 25mg/día.
3. Cambiaría el ibuprofeno por paracetamol para evitar la posible influencia del mismo sobre el efecto de los hipotensores.
4. Añadiría un bloqueante alfa por la elevada prevalencia de síndrome prostático en varones de esta edad.

Respuesta correcta: 3. Cambiaría el ibuprofeno por paracetamol para evitar la posible influencia del mismo sobre el efecto de los hipotensores.